Clinical trial exclusion criterion:
1. Patients over the age of 85 years except at the discretion of the Investigator and with agreement of the Sponsor.

Annotated entities:
- Value: "over the age of 85 years"
- Person: "age"
- Subjective_judgement: "at the discretion of the Investigator"
- Post-eligibility: "Patients over the age of 85 years except at the discretion of the Investigator and with agreement of the Sponsor."